Inability to speak English;

The above is a clinical trial exclusion criterion. Annotated with entity spans:
[Post-eligibility: Inability to speak English];